¿Cuál de los siguientes factores NO se asocia a buen pronóstico del trastorno de conversión?
1. Inicio agudo.
2. Presencia de factores estresantes claramente identificables al inicio de la enfermedad.
3. Cociente intelectual alto.
4. Ausencia de otros trastornos psiquiátricos y procesos legales.
5. Presencia de convulsiones y temblores.

Respuesta correcta: 5. Presencia de convulsiones y temblores.